Clinical trial exclusion criterion:
Beta-lactam allergy

Annotated entities:
- Condition: "allergy"
- Drug: "Beta-lactam"